Clinical trial inclusion criterion:
Confirmed diagnosis (clinical and histological features) of Hailey Hailey or Darier diseases.

Annotated entities:
- Condition: "Hailey Hailey disease"
- Condition: "Darier disease"
- Procedure: "histological"